Diagnosis of probable pancreatic cancer, distal common bile duct (CBD) cholangiocarcinoma and other periampullary cancers (histology not required)

The above is a clinical trial inclusion criterion. Annotated with entity spans:
Diagnosis of [Mood: probable] [Condition: pancreatic cancer], [Condition: distal common bile duct (CBD) cholangiocarcinoma] and [Qualifier: other] [Condition: periampullary cancers] (histology not required)